Clinical trial inclusion criterion:
Clinical diagnosis of acute coronary syndrome

Annotated entities:
- Condition: "acute coronary syndrome"